Clinical trial exclusion criterion:
Patients under the age of 18 years

Entity relations:
- Has_value("age", "under 18 years")